兒童的感染性關節炎（infective arthritis），最常見的菌種為：
A. 金黃色葡萄球菌（Staphylococcus aureus）
B. 大腸桿菌（Escherichia coli）
C. 沙門氏菌（Salmonella species）
D. 黴漿菌（Mycoplasma pneumoniae）

正確答案：A. 金黃色葡萄球菌（Staphylococcus aureus）